Clinical trial exclusion criterion:
Chronic obstructive pulmonary disease

Entity relations:
- Has_multiplier("obstructive pulmonary disease", "Chronic")